Clinical trial exclusion criterion:
History of open bladder, rectosigmoid colon, or other pelvic surgery

Annotated entities:
- Procedure: "open bladder surgery"
- Procedure: "pelvic surgery"
- Procedure: "rectosigmoid colon surgery"